紅血球因缺乏粒線體，其葡萄糖分解的最終產物為何？
A. pyruvate
B. lactate
C. acetyl-CoA
D. CO2

正確答案：B. lactate